10. History of DVT or pulmonary embolism within 6 months;

The above is a clinical trial exclusion criterion. Annotated with entity spans:
[Parsing_Error: 10.] [Temporal: History] of [Condition: DVT] or [Condition: pulmonary embolism] [Temporal: within 6 months];